Living in the Waya Clinic Catchment Area

The above is a clinical trial inclusion criterion. Annotated with entity spans:
[Person: Living] in the [Visit: Waya Clinic Catchment Area]